List markers for autophagy.

Expression of LC3-II and BECN1 as well as SQSTM1 are used as markers of autophagy activity.